Clinical trial inclusion criterion:
Measurable metastatic disease (>1cm) in at least one site other than bone-only

Annotated entities:
- Condition: "metastatic disease"
- Qualifier: "Measurable"
- Value: ">1cm"
- Value: "at least one"
- Qualifier: "site other than bone-only"